Clinical trial inclusion criterion:
Diagnosed with an infection related stone.

Annotated entities:
- Qualifier: "infection related"
- Condition: "stone"